Clinical trial exclusion criterion:
History of sensitivity to heparin or heparin-induced thrombocytopenia.

Entity relations:
- OR("sensitivity to heparin", "heparin-induced thrombocytopenia")